Clinical trial exclusion criterion:
Guardianship patients

Annotated entities:
- Non-query-able: "Guardianship patients"